Clinical trial inclusion criterion:
Written informed consent from legal representative(s)

Annotated entities:
- Informed_consent: "Written informed consent from legal representative(s)"